Fibroscan within 6 months of Baseline/Day1 with a result of = 12.5 kPa

The above is a clinical trial inclusion criterion. Annotated with entity spans:
[Procedure: Fibroscan] [Temporal: within 6 months of Baseline/Day1] with a result of [Value: = 12.5 kPa]